What causes "Puffy hand syndrome"?

Puffy hand syndrome is a complication of intravenous drug abuse.